History of drug abuse or alcohol abuse in the past 12 months.

The above is a clinical trial exclusion criterion. Annotated with entity spans:
[Temporal: History] of [Observation: drug abuse] or [Observation: alcohol abuse] [Temporal: in the past 12 months].